Clinical trial exclusion criterion:
Known subjects with renal, liver, calcium metabolism disorders, malabsorption disorders, known neoplasms.

Annotated entities:
- Condition: "disorders renal"
- Condition: "disorders liver"
- Condition: "calcium metabolism disorders"
- Condition: "malabsorption disorders"
- Condition: "neoplasms"